Clinical trial exclusion criterion:
On treatment with oral anticoagulant

Annotated entities:
- Drug: "anticoagulant"
- Qualifier: "oral"